Clinical trial exclusion criterion:
High bleeding risk surgeries, e.g., Intra-cranial surgery, Intra-spinal surgery, Retinal surgery

Annotated entities:
- Condition: "High bleeding risk surgeries"
- Condition: "Intra-cranial surgery"
- Condition: "Intra-spinal surgery"
- Condition: "Retinal surgery"